Clinical trial exclusion criterion:
ischemic heart disease or any abnormality on treadmill stress test

Entity relations:
- Has_value("treadmill stress test", "abnormality")
- OR("ischemic heart disease", "treadmill stress test")